Clinical trial exclusion criterion:
Patients with coagulopathy or under anti-coagulation therapy.

Entity relations:
- OR("coagulopathy", "anti-coagulation therapy")